關於白斑（vitiligo），下列敘述何者錯誤？
A. 是一種黑色素細胞（melanocyte）沒減少，但黑色素（melanin）減少的疾病
B. 有時與其他自體免疫疾病同時存在
C. 可以考慮 narrowband UVB 治療
D. 病灶的邊界（border）明顯

正確答案：A. 是一種黑色素細胞（melanocyte）沒減少，但黑色素（melanin）減少的疾病